Clinical trial exclusion criterion:
A heart rate less than 50 beats/minute or grade 2 or 3 AV heart block

Annotated entities:
- Measurement: "heart rate"
- Value: "less than 50 beats/minute"
- Condition: "AV heart block"
- Qualifier: "grade 2"
- Qualifier: "grade 3"